Clinical trial exclusion criterion:
Inability to obtain consent

Annotated entities:
- Post-eligibility: "Inability to obtain consent"